Clinical trial inclusion criterion:
Diagnosed with Beta-Thalassemia Major and receiving regular blood transfusion and on iron chelating therapy.

Annotated entities:
- Condition: "Beta-Thalassemia Major"
- Procedure: "blood transfusion"
- Qualifier: "regular"
- Procedure: "iron chelating therapy"